Clinical trial exclusion criterion:
Ulcers older than 1 year.

Annotated entities:
- Condition: "Ulcers"
- Temporal: "older than 1 year"